neurological history or

The above is a clinical trial exclusion criterion. Annotated with entity spans:
[Temporal: neurological history] or